Clinical trial inclusion criteria:
Adult women at least 18 years of age
Elective Female Pelvic Medicine and Reconstructive Surgery or Gynecologic Minimally Invasive surgeries including hysterectomy, suburethral sling, and pelvic organ prolapse repair that require cystoscopy.

Annotated entities:
- Person: "Adult"
- Person: "women"
- Value: "at least 18 years"
- Person: "age"
- Qualifier: "Elective"
- Qualifier: "Female Pelvic"
- Procedure: "Reconstructive Surgery"
- Drug: "Medicine"
- Qualifier: "Gynecologic"
- Qualifier: "Minimally Invasive"
- Procedure: "surgeries"
- Procedure: "hysterectomy"
- Procedure: "suburethral sling"
- Procedure: "pelvic organ prolapse repair"
- Procedure: "cystoscopy"
- Mood: "require"